就心肌酵素於診斷急性冠狀動脈症候群而言，下列敘述何者錯誤？
A. Cardiac troponin 適用於診斷近期發生之心肌梗塞
B. CK-MB 尖峰值出現時間有助於偵測心肌再灌流之發生
C. CK-MB 在急性冠狀動脈症候群之臨床病程中，無法用於偵測再梗塞（reinfarction）
D. Cardiac troponin 可助於急性冠狀動脈症候群之風險分級

正確答案：C. CK-MB 在急性冠狀動脈症候群之臨床病程中，無法用於偵測再梗塞（reinfarction）